若一受測者從臥姿突然站立時，因血壓降低而感到暈眩。此時身體會利用下列那一反應來幫助穩定動脈血壓？
A. 降低動脈感壓受器反射（arterial baroreceptors reflex）放電頻率
B. 降低心跳速率
C. 降低靜脈回流（venous return）
D. 促使小動脈（arterioles）舒張

正確答案：A. 降低動脈感壓受器反射（arterial baroreceptors reflex）放電頻率